Patients with a seizure history, history of recurrent falls, or known brain metastases are excluded from this clinical trial because of their poor prognosis and because of their heightened risk of seizure or progressive cognitive and/or neurologic dysfunction that would confound the evaluation.

The above is a clinical trial exclusion criterion. Annotated with entity spans:
Patients with a [Condition: seizure] [Temporal: history], [Temporal: history of] [Condition: recurrent falls], or known [Condition: brain metastases] are excluded from this clinical trial because of their poor prognosis and because of their heightened risk of seizure or progressive cognitive and/or neurologic dysfunction that would confound the evaluation.